Clinical trial exclusion criterion:
Slowed heart rate, causing symptoms (symptomatic bradycardia),

Annotated entities:
- Condition: "heart rate"
- Qualifier: "Slowed"
- Condition: "bradycardia"
- Qualifier: "symptomatic"
- Condition: "symptoms"